有關以雙磷酸鹽藥物治療骨質疏鬆症之敘述，下列何者錯誤？
A. 主要與骨骼中羥基磷灰石（hydroxyapatite）結合
B. 已證實可有效增加骨質密度
C. 不須合併使用鈣片及維生素 D
D. 有預防再次骨折的功效

正確答案：C. 不須合併使用鈣片及維生素 D